Has greater than or equal to (>=) Grade 2 peripheral neuropathy, or Grade 1 with pain on clinical examination during the screening period.

The above is a clinical trial exclusion criterion. Annotated with entity spans:
Has [Qualifier: greater than or equal to (>=) Grade 2] [Condition: peripheral neuropathy], or [Qualifier: Grade 1] with [Condition: pain] on clinical examination during the screening period.